angioplasty with stenting

The above is a clinical trial exclusion criterion. Annotated with entity spans:
[Procedure: angioplasty with stenting]